A medida que aumentan los grados de libertad, la distribución t de Student se aproxima a:
1. La distribución normal.
2. La distribución binomial.
3. La distribución F de Snedecor.
4. La distribución uniforme.
5. La distribución Chi cuadrado.

Respuesta correcta: 1. La distribución normal.